骨骼肌產生收縮所需之 ATP，最先由何方式產生？
A. 磷酸肌酸（creatine phosphate）轉移出能量和磷酸根與 ADP 結合
B. 氧化磷酸化反應（oxidative phosphorylation）
C. 醣分解反應（glycolysis）
D. 脂肪酸（fatty acid）氧化

正確答案：A. 磷酸肌酸（creatine phosphate）轉移出能量和磷酸根與 ADP 結合